La técnica operante denominada “reforzamiento diferencial de otras conductas” es un procedimiento habitual para:
1. Instaurar nuevas conductas.
2. Castigar las conductas no deseadas.
3. Eliminar o reducir conductas.
4. Generar estrés psicológico por incompatibilidad entre conductas.
5. Extinguir las creencias irracionales.

Respuesta correcta: 3. Eliminar o reducir conductas.